18 歲少女未婚懷孕，未得良好產前照護，營養不足沒有補充綜合維他命或鐵劑，懷孕末期容易疲倦體力衰弱，嬰兒在 35 週出生，活動力較差，抽血檢查發現媽媽及嬰兒含鐵蛋白（ferritin）均較低。 下列何種情況最可能同時發生在媽媽及嬰兒？
A. 周邊神經病變
B. 甲狀腺腫大
C. 小球性貧血
D. 維生素 B12缺乏

正確答案：C. 小球性貧血